Clinical trial inclusion criteria:
Type 2 diabetes
Age 18 - 75 years
Anti-GAD antibodies negative (Glutamic Acid Decarboxylase)
C-peptide levels = 1.5 ng/mL
Fasting blood glucose > 126 mg/dl
HbA1c 8.0 - 10.5 %
BMI 25.0 - 45.0 kg/m2
Previous therapy with BBIT (basal insulin and at least once daily bolus insulin)

Annotated entities:
- Condition: "Type 2 diabetes"
- Person: "Age"
- Value: "18 - 75 years"
- Measurement: "Anti-GAD antibodies (Glutamic Acid Decarboxylase)"
- Value: "negative"
- Measurement: "C-peptide levels"
- Value: "= 1.5 ng/mL"
- Measurement: "Fasting blood glucose"
- Value: "> 126 mg/dl"
- Measurement: "HbA1c"
- Value: "8.0 - 10.5 %"
- Measurement: "BMI"
- Value: "25.0 - 45.0 kg/m2"
- Temporal: "Previous"
- Procedure: "therapy"
- Drug: "BBIT"
- Drug: "basal insulin and at least once daily bolus insulin"